Clinical trial inclusion criterion:
aged 18 or older,

Annotated entities:
- Person: "aged"
- Value: "18 or older"